Las Archaea se diferencian de las bacterias en que:
1. Sus membranas poseen una sola capa fosfolipídica.
2. Poseen varios cromosomas.
3. Sus membranas poseen éteres de glicerol.
4. No son susceptibles a la infección viral.
5. No presentan pared celular.

Respuesta correcta: 3. Sus membranas poseen éteres de glicerol.